3. Diagnosis of chronic myelogenous leukemia (CML) in blast crisis

The above is a clinical trial exclusion criterion. Annotated with entity spans:
3. Diagnosis of [Condition: chronic myelogenous leukemia (CML)] in [Condition: blast crisis]